社區感染性肺炎，最常見的非典型致病原不包括下列何者？
A. Chlamydia pneumoniae
B. Mycoplasma pneumoniae
C. Klebsiella pneumoniae
D. Legionella pneumophila

正確答案：C. Klebsiella pneumoniae